What is the mode of action of filgotinib?

Efficacy and safety of filgotinib, a selective Janus kinase 1 inhibitor,